Clinical trial inclusion criterion:
willingness to transmit glucose and medication information weekly

Annotated entities:
- Non-query-able: "willingness to transmit glucose and medication information weekly"